Clinical trial exclusion criteria:
Genotype 2, 3, 5 or 6 infection.
Decompensated cirrhosis defined by the presence of actual or previous history of clinical decompensation including ascites, hepatic encephalopathy, variceal bleeding or spontaneous bacterial peritonitis, or a Child-Pugh B or C.
Hepatocellular carcinoma after liver transplantation.
Total bilirubin > 3 mg/dL.
Immunosuppression with cyclosporine or an mTOR inhibitor (everolimus or sirolimus).
Severe extrahepatic diseases: cardiovascular, respiratory, cerebrovascular and poorly controlled diabetes.
Platelets < 75 x 109 cells/L.
Neutrophil count < 0.5 x 109 cells/L.
Hemoglobin < 9 g/dL.
Albumin < 3g/dL.
HIV infection.
Hepatitis B infection.
Active intake of toxic amounts of alcohol or recreational drugs.
Females who are pregnant, become to be pregnant or breastfeeding or males whose partners are pregnant, become to be pregnant or breastfeeding.
Intake of disallowed medications including(but not limited to):
1. Antibiotics: clarithromycin, erythromycin, telithromycin, nafcillin, rifampin
2. Antifungals: itraconazole, ketoconazole, voriconazole
3. Antihypertensives: nifedipine
4. Anticonvulsants: carbamazepine, phenytoin, phenobarbital
5. Bosentan
6. Modafinil
7. St.Jonh's Wort
8. Immunosuppressants: cyclosporin, everolimus, sirolimus
9. Diabetes agents: glibenclamide, glyburide
10. Lipid lowering agents: gemfibrozil
11. Eltrombopag
12. Lapatinib
13. HIV medications: efavirenz, etravirine, all ritonavir boosted and unboosted HIV protease inhibitors
14. Statins: simvastatin, fluvastatin, rosuvastatin at doses greater than 10 mg/d, atorvastatin at doses greater than 10 mg/d.

Annotated entities:
- Measurement: "Genotype"
- Value: "2, 3, 5 or 6"
- Condition: "infection"
- Condition: "cirrhosis"
- Qualifier: "Decompensated"
- Condition: "clinical decompensation"
- Undefined_semantics: "clinical decompensation"
- Condition: "ascites"
- Condition: "hepatic encephalopathy"
- Condition: "variceal bleeding"
- Condition: "spontaneous bacterial peritonitis"
- Measurement: "Child-Pugh"
- Value: "B or C"
- Temporal: "actual"
- Temporal: "previous"
- Condition: "Hepatocellular carcinoma"
- Procedure: "liver transplantation"
- Reference_point: "liver transplantation"
- Temporal: "after liver transplantation"
- Measurement: "Total bilirubin"
- Value: "> 3 mg/dL"
- Procedure: "Immunosuppression"
- Drug: "cyclosporine"
- Drug: "mTOR inhibitor"
- Drug: "everolimus"
- Drug: "sirolimus"
- Condition: "extrahepatic diseases"
- Undefined_semantics: "extrahepatic diseases"
- Qualifier: "Severe"
- Undefined_semantics: "Severe"
- Subjective_judgement: "Severe"
- Condition: "cardiovascular"
- Condition: "respiratory"
- Condition: "cerebrovascular"
- Condition: "diabetes"
- Qualifier: "poorly controlled"
- Grammar_Error: "and"
- Measurement: "Platelets"
- Value: "< 75 x 109 cells/L"
- Measurement: "Neutrophil count"
- Value: "< 0.5 x 109 cells/L"
- Measurement: "Hemoglobin"
- Value: "< 9 g/dL"
- Measurement: "Albumin"
- Value: "< 3g/dL"
- Condition: "HIV infection"
- Condition: "Hepatitis B infection"
- Condition: "alcohol"
- Multiplier: "toxic amounts"
- Undefined_semantics: "toxic amounts"
- Condition: "recreational drugs"
- Temporal: "Active intake"
- Condition: "pregnant"
- Person: "Females"
- Observation: "become"
- Condition: "pregnant"
- Observation: "breastfeeding"
- Non-query-able: "partners are pregnant, become to be pregnant or breastfeeding"
- Person: "males"
- Drug: "disallowed medications"
- Parsing_Error: "Intake of disallowed medications including(but not limited to):"
- Parsing_Error: "1."
- Drug: "clarithromycin"
- Drug: "erythromycin"
- Drug: "telithromycin"
- Drug: "nafcillin"
- Drug: "rifampin"
- Parsing_Error: "2."
- Drug: "itraconazole"
- Drug: "ketoconazole"
- Drug: "voriconazole"
- Parsing_Error: "3."
- Drug: "nifedipine"
- Parsing_Error: "4."
- Drug: "carbamazepine"
- Drug: "phenytoin"
- Drug: "phenobarbital"
- Parsing_Error: "5."
- Drug: "Bosentan"
- Parsing_Error: "6."
- Drug: "Modafinil"
- Parsing_Error: "7."
- Drug: "St.Jonh's Wort"
- Parsing_Error: "8."
- Drug: "cyclosporin"
- Drug: "everolimus"
- Drug: "sirolimus"
- Parsing_Error: "9."
- Drug: "glibenclamide"
- Drug: "glyburide"
- Parsing_Error: "10."
- Drug: "gemfibrozil"
- Parsing_Error: "11."
- Drug: "Eltrombopag"
- Parsing_Error: "12."
- Drug: "Lapatinib"
- Parsing_Error: "13."
- Drug: "HIV protease inhibitors"
- Drug: "ritonavir"
- Drug: "etravirine"
- Qualifier: "ritonavir unboosted"
- Qualifier: "ritonavir boosted"
- Grammar_Error: "and"
- Drug: "efavirenz"
- Parsing_Error: "14."
- Multiplier: "doses greater than 10 mg/d"
- Drug: "simvastatin"
- Drug: "fluvastatin"
- Drug: "rosuvastatin"
- Drug: "atorvastatin"
- Multiplier: "doses greater than 10 mg/d"